支配耳下腺（parotid gland）的副交感神經節前神經細胞體位於：
A. 上唾液核（superior salivatory nucleus）
B. 下唾液核（inferior salivatory nucleus）
C. 疑核（nucleus ambiguus）
D. 三叉神經脊髓徑核（spinal trigeminal nucleus）

正確答案：B. 下唾液核（inferior salivatory nucleus）